Moderate to advanced generalized chronic periodontitis

The above is a clinical trial inclusion criterion. Annotated with entity spans:
[Qualifier: Moderate to advanced] [Condition: generalized chronic periodontitis]